En la elección del tipo de prótesis valvular cardiaca (biológica o mecánica) a implantar en un paciente se deben considerar diversos aspectos y características del enfermo y de la prótesis. Atendiendo a lo mencionado, señale el enunciado INCORRECTO:
1. La anticoagulación permanente es necesaria en las prótesis mecánicas.
2. En general las prótesis biológicas se indican en pacientes jóvenes, con esperanza de vida larga.
3. Las prótesis biológicas estarían indicadas en casos que presenten contraindicación formal para la anticoagulación.
4. La velocidad de deterioro estructural de una prótesis biológica es inversamente proporcional a la edad del sujeto.
5. Las prótesis biológicas no precisan anticoagulación permanente.

Respuesta correcta: 2. En general las prótesis biológicas se indican en pacientes jóvenes, con esperanza de vida larga.